不常用來治療三叉神經痛之手術方法為：
A. 顯微血管減壓術（Microvascular decompression, MVD）
B. 燒灼術（Gasserian ganglion）
C. 伽馬刀（Gamma knife surgery）
D. 三叉神經完全切斷手術

正確答案：D. 三叉神經完全切斷手術